Clinical trial exclusion criterion:
Pulmonary air leaks;

Annotated entities:
- Condition: "Pulmonary air leaks"